What is the main application of SWATH-MS in proteomics?

Using the method called SWATH-MS one might ask sample sets for the presence and quantity of essentially any protein of interest.